有關肛門內痔瘡（internal hemorrhoids）的描述，下列何者錯誤？
A. 根據internal hemorrhoids嚴重程度的分級，會prolapse with spontaneous reduction的痔瘡是屬於第三級
B. 大部分痔瘡症狀是可以藉由飲食調整改善，包含多喝水、攝食食物纖維
C. 針對痔瘡病患就診時必須做digital examination，以排除其他肛門腫瘤的可能性
D. 若是病患年紀大於40歲且有家族大腸癌病史，痔瘡並不嚴重但有血便，必須考慮安排大腸鏡排除大腸癌的可能性

正確答案：A. 根據internal hemorrhoids嚴重程度的分級，會prolapse with spontaneous reduction的痔瘡是屬於第三級